History of another malignancy except: Malignancy treated with curative intent and with no known active disease present for >=5 years prior to enrolment and felt to be at low risk for recurrence by the treating physician; Adequately treated non-melanomatous skin cancer or lentigo maligna without evidence of disease; Adequately treated cervical carcinoma in situ without evidence of disease; Prostatic intraepithelial neoplasia without evidence of prostate cancer.

The above is a clinical trial exclusion criterion. Annotated with entity spans:
History of [Qualifier: another] [Condition: malignancy] [Negation: except]: [Condition: Malignancy] [Procedure: treated with curative intent] and with [Negation: no] known [Condition: active disease] present [Temporal: for >=5 years prior to enrolment] and [Mood: felt to be at low risk] for [Condition: recurrence] by the treating physician; [Qualifier: Adequately] [Procedure: treated] [Condition: non-melanomatous skin cancer] or [Condition: lentigo maligna] [Negation: without] [Condition: evidence of disease]; [Qualifier: Adequately] [Procedure: treated] [Condition: cervical carcinoma in situ] [Negation: without] [Mood: evidence of] [Condition: disease]; [Condition: Prostatic intraepithelial neoplasia] [Negation: without] [Mood: evidence of] [Condition: prostate cancer].